Previous biliary drainage by ERCP/PTC

The above is a clinical trial exclusion criterion. Annotated with entity spans:
[Temporal: Previous] [Procedure: biliary drainage by ERCP/PTC]